下列那一種微生物主要在人類細胞內繁殖，且可引起透過性行為傳染的疾病？
A. 傷寒桿菌 （Salmonella Typhi）
B. 杜克氏嗜血桿菌 （Haemophilus ducreyi）
C. 普氏立克次體（Rickettsia prowazekii）
D. 砂眼披衣菌（Chlamydia trachomatis）

正確答案：D. 砂眼披衣菌（Chlamydia trachomatis）